7) HRSD question #9 regarding suicide <2,

The above is a clinical trial inclusion criterion. Annotated with entity spans:
[Parsing_Error: 7)] [Measurement: HRSD question #9] regarding suicide [Value: <2],